Clinical trial exclusion criteria:
Clinically significant cardiac disease (New York Heart Association Class III/IV),or severe debilitating puhnonary disease.
Uncontrolled serious active infection.
Anticipated survival of less than 3 months.
Active CNS or epiduraltumor
Inability or unwillingness to comply with the treatment protocol, follow-up, or research tests.

Annotated entities:
- Condition: "cardiac disease"
- Measurement: "New York Heart Association"
- Value: "Class III/IV"
- Qualifier: "significant"
- Condition: "debilitating puhnonary disease"
- Qualifier: "severe"
- Condition: "infection"
- Qualifier: "Uncontrolled serious"
- Observation: "Anticipated survival"
- Value: "less than 3 months"
- Condition: "CNS tumor"
- Condition: "epiduraltumor"
- Condition: "Inability"
- Observation: "unwillingness"
- Informed_consent: "comply with the treatment protocol"
- Procedure: "follow-up"
- Post-eligibility: "research tests"